Clinical trial exclusion criterion:
uncontrolled hypertension

Entity relations:
- Has_qualifier("hypertension", "uncontrolled")